No bloquea el flujo de electrones en la fosforilación oxidativa:
1. Cianuro.
2. Antimicina A.
3. CO.
4. 2,4-DNP.
5. Amital.

Respuesta correcta: 4. 2,4-DNP.